抗利尿激素（ADH）分泌不足，會導致尿崩症（diabetes insipidus）。下列有關病人身體內變化的敘述，何者錯誤？
A. 血漿中的滲透壓（plasma osmolarity）會上升
B. 血漿中的鈉離子（plasma sodium）濃度會上升
C. 血漿中的腎素（renin）濃度會下降
D. 細胞外組織間質液（interstitial fluid）的淨水壓（hydrostatic pressure）會下降

正確答案：C. 血漿中的腎素（renin）濃度會下降